Clinical trial exclusion criteria:
Renal insufficiency (> 265 µmol/l)
Incapability to give informed consent
Cardiogenic shock of patient with KILLIP III or IV
pregnant or breast feeding females
insufficient contraception (only for substudy 3)

Annotated entities:
- Condition: "Renal insufficiency"
- Non-representable: "(> 265 µmol/l)"
- Informed_consent: "Incapability to give informed consent"
- Condition: "Cardiogenic shock"
- Measurement: "KILLIP"
- Value: "III or IV"
- Condition: "pregnant"
- Observation: "breast feeding"
- Person: "females"
- Qualifier: "insufficient"
- Procedure: "contraception"